Bone age reading more than 14.0 years

The above is a clinical trial exclusion criterion. Annotated with entity spans:
[Measurement: Bone age] reading [Value: more than 14.0 years]